Clinical trial exclusion criterion:
Severe kidney failure (eGFR<15 ml/min)

Entity relations:
- Has_qualifier("kidney failure", "Severe")
- Has_value("eGFR", "<15 ml/min")
- Subsumes("kidney failure", "eGFR")